有關於鼻咽血管纖維瘤（angiofibroma）之敘述，下列何者正確？
A. 是鼻咽部最常見之良性腫瘤
B. 男女發生率差不多
C. 以中老年者居多
D. 放射治療是主要治療方式

正確答案：A. 是鼻咽部最常見之良性腫瘤